Clinical trial exclusion criterion:
Patient refusal for supraclavicular block

Entity relations:
- AND("Patient refusal", "supraclavicular block")